Clinical trial exclusion criterion:
Is not a habitual wearer of Avaira sphere lenses

Annotated entities:
- Device: "Avaira sphere lenses"